下列有關大腦皮質運動區的敘述，何者錯誤？
A. 初級運動皮質可發出皮質脊髓徑支配下運動神經元（lower motor neuron）
B. premotor area 與 supplementary motor area 參與複雜動作之計畫與順序性
C. 下運動神經元（lower motor neuron）皆由對側大腦皮質所發出之 corticospinal tract 或 corticobulbar tract 支配
D. 大腦皮質運動區接受丘腦之訊息

正確答案：C. 下運動神經元（lower motor neuron）皆由對側大腦皮質所發出之 corticospinal tract 或 corticobulbar tract 支配